Según la clasificación de Tyrer (1989), ¿a qué tipo de disociación pertenece la amnesia psicógena (amnesia disociativa)?:
1. La disociación de la personalidad.
2. La disociación de la función cognitiva.
3. La disociación de la percepción.
4. La disociación del movimiento o sensación.
5. La disociación de conductas complejas.

Respuesta correcta: 2. La disociación de la función cognitiva.